¿Qué técnica, fundamentada en la teoría del aprendizaje social, se considera bien establecida para el tratamiento de los miedos infantiles?
1. La práctica reforzada.
2. Las autoinstrucciones de valentía.
3. El modelamiento.
4. El modelado con participación.
5. La exposición en vivo.

Respuesta correcta: 4. El modelado con participación.